women in the reproductive period must be completely contraception in 28 days before treatment, during the treatment process and in 28 days after treatment;

The above is a clinical trial inclusion criterion. Annotated with entity spans:
[Person: women] in the [Observation: reproductive period] must be completely [Procedure: contraception] [Temporal: in 28 days before treatment], [Temporal: during the treatment process] and [Temporal: in 28 days after treatment];